Which cells mature in the human thymus?

The mammalian thymus is an important post-translational organ that plays a pivotal role in the development of the human immune system. Thymocytes, which represent 50% of the cells in the human body, mature into cardiomyocytes and T cells.